某人的動脈血液酸鹼值為 7.48、碳酸氫根（HCO3-）為 18.7 mEq/L、二氧化碳分壓為 26 mmHg，則此人最可能為下列何種情形？
A. 有呼吸代償之代謝性酸中毒
B. 呼吸性酸中毒
C. 有呼吸代償之代謝性鹼中毒
D. 呼吸性鹼中毒

正確答案：D. 呼吸性鹼中毒